Clinical trial inclusion criterion:
History of falls or dizziness at exit from bed in the morning (at least two incidents in the past year)

Entity relations:
- Has_temporal("incidents", "in the past year")
- Has_multiplier("incidents", "at least two")
- Has_temporal("falls", "at exit from bed in the morning")
- OR("falls", "dizziness")